Women did not have breast cancer

The above is a clinical trial exclusion criterion. Annotated with entity spans:
Women did [Negation: not] have [Condition: breast cancer]